Clinical trial exclusion criterion:
Likely source to be from (proven or suspected at the time of randomisation) the central nervous system, e.g. brain abscess, post-surgical meningitis, shunt infection (due to concerns over CNS penetration of piperacillin/tazobactam)

Annotated entities:
- Condition: "brain abscess"
- Condition: "meningitis"
- Qualifier: "post-surgical"
- Condition: "shunt infection"